Use of anticoagulation therapy

The above is a clinical trial exclusion criterion. Annotated with entity spans:
Use of [Procedure: anticoagulation therapy]